白血球黏著分子缺損所導致的免疫功能障礙中，下列那一項敘述最為正確？
A. 血液中的白血球數目下降
B. 發炎組織中的白血球浸潤減少
C. 白血球對補體的反應增強
D. 白血球的游走（migration）不受影響

正確答案：B. 發炎組織中的白血球浸潤減少